Clinical trial inclusion criterion:
Not currently engaged in > 60 min/wk of exercise

Entity relations:
- Has_temporal("engaged in exercise", "currently")
- Has_value("engaged in exercise", "> 60 min/wk")
- Has_negation("engaged in exercise", "Not")